Clinical trial exclusion criterion:
Allergy or previous adverse reaction to prazosin or other alpha-1 antagonist

Annotated entities:
- Condition: "Allergy"
- Condition: "adverse reaction"
- Temporal: "previous"
- Drug: "prazosin"
- Drug: "alpha-1 antagonist"
- Qualifier: "other"